31歲女性，在懷孕第35週時出現高血壓，水腫，蛋白尿，和肝功能異常。下列有關此病的敘述何者錯誤？
A. 此病較易發生在多次懷孕的婦女
B. 病人易有血小板低下
C. 肝臟會出現纖維蛋白血栓（fibrin thrombi）
D. 引產是對此病人的合適治療方法

正確答案：A. 此病較易發生在多次懷孕的婦女